Clinical trial exclusion criterion:
Exacerbation of chronic diseases;

Annotated entities:
- Condition: "Exacerbation"
- Condition: "chronic diseases"